下列何種現象經常是病例對照研究結果產生偏差（bias）的來源？
A. 健康工人效應
B. 研究樣本失去追蹤
C. 研究對象通常是自願者
D. 研究對象無法正確回憶過去的暴露情形

正確答案：D. 研究對象無法正確回憶過去的暴露情形